Creatinine =< 1.5 x upper limit of normal

The above is a clinical trial inclusion criterion. Annotated with entity spans:
[Measurement: Creatinine] [Value: =< 1.5 x upper limit of normal]